一位 32 歲未婚男性患者，擔任經理職務。3 個月前在一次會議發言時，因準備不夠充分出現緊張、不自然、臉紅。之後當眾發言時，便會有出汗、頭暈、心慌、噁心等身體不適感，因此逃避任何需公眾發言之場合。本案例最可能的診斷是：
A. 廣泛性焦慮症（generalized anxiety disorder）
B. 恐慌症（panic disorder）
C. 社交焦慮症（social anxiety disorder）
D. 廣場恐懼症（agoraphobia）

正確答案：C. 社交焦慮症（social anxiety disorder）